Clinical trial exclusion criterion:
Uncontrolled intercurrent illness including, but not limited to, uncontrolled diabetes, ongoing or active infection, symptomatic congestive heart failure (New York Heart Association Class III and IV heart failure), unstable angina pectoris, cardiac arrhythmia, or psychiatric illness/social situations/substance abuse that would limit compliance with study requirements.

Annotated entities:
- Condition: "intercurrent illness"
- Qualifier: "Uncontrolled"
- Qualifier: "uncontrolled"
- Condition: "diabetes"
- Temporal: "ongoing"
- Qualifier: "active"
- Condition: "infection"
- Qualifier: "symptomatic"
- Condition: "congestive heart failure"
- Measurement: "New York Heart Association"
- Value: "Class III and IV"
- Condition: "heart failure"
- Condition: "unstable angina pectoris"
- Condition: "cardiac arrhythmia"
- Condition: "psychiatric illness"
- Condition: "social situations"
- Condition: "substance abuse"